Clinical trial inclusion criterion:
Non-pregnant, non-lactating female patients, whose screening pregnancy test is negative and who are using contraceptive methods deemed reliable by the investigator, or who are at least 2 years post-menopausal or surgically sterilized.

Entity relations:
- Has_value("pregnancy test", "negative")
- Has_negation("pregnant", "Non")
- Has_negation("lactating", "non")
- AND("surgically sterilized", "surgically")
- Has_qualifier("contraceptive methods", "deemed reliable by the investigator")
- AND("deemed reliable by the investigator", "deemed reliable by the investigator")
- Has_temporal("post-menopausal", "at least 2 years")
- AND("pregnant", "pregnancy test")
- OR("post-menopausal", "surgically sterilized")
- OR("pregnancy test", "post-menopausal", "contraceptive methods")